En un ensayo clínico que evalúa la eficacia de un hipolipemiante en la prevención primaria de la cardiopatía coronaria, si los investigadores han planificado análisis de resultados intermedios y a la vista de ellos suspenden el estudio antes de su finalización tienen que saber que:
1. Sólo puede ser interrumpido el estudio cuando en algún análisis intermedio hay una diferencia entre los resultados de las intervenciones, p < 0,05.
2. Sólo está justificada la interrupción en aquellos estudios que tienen como variable de resultado la mortalidad.
3. Si la intervención es segura el estudio no puede interrumpirse antes de que haya finalizado.
4. Cuando se interrumpe precozmente un ensayo clínico es frecuente que se sobrestime el efecto de la intervención evaluada.
5. La realización de análisis intermedios disminuye el error tipo I.

Respuesta correcta: 4. Cuando se interrumpe precozmente un ensayo clínico es frecuente que se sobrestime el efecto de la intervención evaluada.